艾姆氏測試法（Ames test）可用於評估：
A. 細菌之致病性
B. DNA複製的速率
C. 抗生素的藥效
D. 化合物致突變性的能力

正確答案：D. 化合物致突變性的能力